Clinical trial exclusion criterion:
Serious chronic disease including any medically significant chronic pulmonary, cardiovascular, renal, neurological, psychiatric or metabolic disorder, as determined by medical history and physical examination.

Annotated entities:
- Condition: "chronic pulmonary disorder"
- Condition: "chronic cardiovascular disorder"
- Condition: "chronic renal disorder"
- Condition: "chronic neurological disorder"
- Condition: "chronic psychiatric disorder"
- Condition: "chronic metabolic disorder"
- Qualifier: "Serious"
- Condition: "chronic disease"